Known or suspected liver diseases

The above is a clinical trial exclusion criterion. Annotated with entity spans:
[Qualifier: Known] or [Qualifier: suspected] [Condition: liver diseases]